Clinical trial exclusion criterion:
Subject has an allergy or other known contraindication to the medications used in the study.

Entity relations:
- AND("allergy", "medications used in the study")
- OR("allergy", "contraindication")